The other types of pulmonary hypertension.

The above is a clinical trial exclusion criterion. Annotated with entity spans:
The [Qualifier: other types] of [Condition: pulmonary hypertension].